Hypersensitivity to antiplatelet and/or anticoagulant drugs;

The above is a clinical trial exclusion criterion. Annotated with entity spans:
[Condition: Hypersensitivity] to [Drug: antiplatelet] and/or [Drug: anticoagulant drugs];